一位中風病患併有右側偏癱與吞嚥困難，檢查發現食物會堆積（pooling）在右側之咽喉區，則下列何種治療最適當？
A. 上聲門吞嚥手法（supraglottic swallow）
B. 頭傾斜至左側（tilting of head to left side）
C. 下巴內縮（chin tuck）
D. 孟德森吞嚥手法（Mendelsohn's maneuver）

正確答案：B. 頭傾斜至左側（tilting of head to left side）